Clinical trial exclusion criterion:
Pre-existing/chronic back pain

Entity relations:
- Has_temporal("back pain", "Pre-existing")
- OR("Pre-existing", "chronic")